(4) Female subjects who agreed to abstinence during the clinical trial period.

The above is a clinical trial exclusion criterion. Annotated with entity spans:
(4) [Pregnancy_considerations: Female subjects who agreed to abstinence during the clinical trial period].